57歲女性病人有挑食的習慣，幾天沒解大便，腹脹不舒服去看門診，醫師說她是代謝方面引起的急性便秘，下列何情況較不易引起急性便秘？
A. Hypothyroidism
B. Hypoadrenalism
C. Hypokalemia
D. Hypocalcemia

正確答案：D. Hypocalcemia